What is included in the fourth generation HIV test?

Fourth generation assays detect simultaneously antibodies for HIV and the p24 antigen. It identifies HIV infection earlier than previous generation tests.